18. Human immunodeficiency virus positivity

The above is a clinical trial exclusion criterion. Annotated with entity spans:
18. [Condition: Human immunodeficiency virus] [Value: positivity]